Clinical trial inclusion criterion:
Lipid-rich plaque on NIRS(Intracoronary Near-Infrared Spectroscopy) (defined as maxLCBI4mm>315)

Entity relations:
- Subsumes("NIRS", "Intracoronary Near-Infrared Spectroscopy")
- AND("NIRS", "Lipid-rich plaque")
- Has_value("maxLCBI4mm", ">315")
- Subsumes("Lipid-rich plaque", "maxLCBI4mm")